下列何者不是病人長期臥床不動（immobilization）之後的生理機能反應？
A. 肌肉萎縮
B. 肌力減退
C. 韌帶鬆弛，延展性增加
D. 動作協調性變差

正確答案：C. 韌帶鬆弛，延展性增加